IAP between 12 and 20 mmHg in at least two consecutive measurements within 1-12 h

The above is a clinical trial inclusion criterion. Annotated with entity spans:
[Measurement: IAP] [Value: between 12 and 20 mmHg] in [Multiplier: at least two consecutive measurements] [Temporal: within 1-12 h]